Clinical trial inclusion criterion:
Patients less than 16 years old with newly diagnosed PML-RARa positive acute promyelocytic leukemia.

Entity relations:
- Has_value("old", "less than 16 years")
- Has_value("PML-RARa", "positive")
- AND("acute promyelocytic leukemia", "PML-RARa")